Clinical trial exclusion criteria:
Allergy to ceftriaxone or macrolides
Major typhoid fever-associated complications
Inability to swallow oral medication
Underlying illness
Pregnancy
Lactation
Treatment within the past 4 days with an antibiotic that may be effective against typhoid fever

Annotated entities:
- Drug: "ceftriaxone"
- Drug: "macrolides"
- Condition: "Allergy"
- Qualifier: "typhoid fever-associated"
- Condition: "typhoid fever"
- Condition: "complications"
- Qualifier: "Major"
- Subjective_judgement: "Major"
- Drug: "oral medication"
- Condition: "Inability to swallow oral medication"
- Condition: "Underlying illness"
- Undefined_semantics: "Underlying illness"
- Condition: "Pregnancy"
- Condition: "Lactation"
- Temporal: "within the past 4 days"
- Drug: "antibiotic"
- Qualifier: "effective against typhoid fever"
- Condition: "typhoid fever"